La Iperita o gas mostaza es un:
1. Agente vesicante.
2. Arma biológica.
3. Agente fitotóxico.
4. Agente incendiario.
5. Agente neurotóxico.

Respuesta correcta: 1. Agente vesicante.